Patients with history of glucose intolerance or diabetes.

The above is a clinical trial exclusion criterion. Annotated with entity spans:
Patients with [Temporal: history] of [Condition: glucose intolerance] or [Condition: diabetes].